Uncontrolled thyroid disorders.

The above is a clinical trial exclusion criterion. Annotated with entity spans:
[Qualifier: Uncontrolled] [Condition: thyroid disorders].